一位 40 歲男業務員因咳嗽而就醫，他有抽菸習慣，每天約抽 30 支。你與他討論抽菸的健康危害與戒菸的好處，病人準備採取戒菸行動，並認真計劃在一個月內改變。此時病人屬於戒菸行為改變階段的那一期？
A. 沈思前期（precontemplation stage）
B. 沈思期（contemplation stage）
C. 準備期（preparation stage）
D. 行動期（action stage）

正確答案：C. 準備期（preparation stage）